Cerebral palsy

The above is a clinical trial exclusion criterion. Annotated with entity spans:
[Condition: Cerebral palsy]